Clinical trial exclusion criterion:
Pregnant, lactating, or planning to become pregnant during the course of the trial;

Entity relations:
- Has_mood("pregnant", "planning to become")
- Has_temporal("Pregnant", "during the course of the trial")
- OR("Pregnant", "lactating", "pregnant")